having experienced severe allergies, trauma history and/or operation history within 3 months.

The above is a clinical trial exclusion criterion. Annotated with entity spans:
having experienced [Qualifier: severe] [Condition: allergies], [Condition: trauma] [Temporal: history] and/or [Procedure: operation] [Temporal: history] [Temporal: within 3 months].